急速進行性腎小球腎炎（rapidly progressive glomerulonephritis）之病理變化特徵為何？
A. 基底膜變厚（basement membrane thickening）
B. 足細胞融合（podocyte fusion）
C. 新月形形成（crescent formation）
D. 大量免疫複合體沉積（immune complex deposition）

正確答案：C. 新月形形成（crescent formation）